Clinical trial inclusion criterion:
Inpatients having major foot and ankle surgery that will benefit from continuous popliteal sciatic nerve block with an indwelling catheter

Annotated entities:
- Visit: "Inpatients"
- Procedure: "major foot and ankle surgery"
- Device: "indwelling catheter"
- Procedure: "popliteal sciatic nerve block"
- Qualifier: "continuous"